Clinical trial inclusion criterion:
5. Subject has clinical evidence of ischemic heart disease in terms of a positive functional study, or documented symptoms.

Annotated entities:
- Condition: "ischemic heart disease"
- Observation: "clinical evidence"
- Procedure: "functional study"
- Value: "positive"